一位 1 個月大的新生兒因為尿液呈粉紅色前來檢查，除此之外沒有其他症狀或異常徵候。其尿液的 occult blood陰性，顯微鏡檢查的紅血球數目為2-4/high power field（HPF），白血球數目為0-2/HPF。下列那一項是最常見的原因？
A. Myoglobulinemia
B. hemolytic anemia
C. urinary stone
D. precipitated urates

正確答案：D. precipitated urates